Current use of Monoamine Oxidase Inhibitors (MAOIs), including the antibiotic linezolid and the thiazine dye methylthioninium chloride (methylene blue)

The above is a clinical trial exclusion criterion. Annotated with entity spans:
Current use of [Drug: Monoamine Oxidase Inhibitors (MAOIs)], including the [Drug: antibiotic linezolid] and the [Drug: thiazine dye] [Drug: methylthioninium chloride] ([Drug: methylene blue])